Clinical trial exclusion criterion:
3. Previous episode of S. aureus bacteremia within 3 months.

Entity relations:
- Has_temporal("S. aureus bacteremia", "within 3 months")